Clinical trial exclusion criterion:
usage of painkiller before surgery

Annotated entities:
- Drug: "painkiller"
- Temporal: "before surgery"